Use of any other endoscopic method to stop GI bleeding beyond endoscopic band ligation

The above is a clinical trial exclusion criterion. Annotated with entity spans:
Use of [Negation: any other] [Procedure: endoscopic method] to stop [Condition: GI bleeding] beyond [Procedure: endoscopic band ligation]